下列何種激素受器的位置是在細胞膜上？
A. 維生素 D（vitamin D）
B. 生長激素（growth hormone）
C. 皮質素（cortisol）
D. 甲狀腺素（thyroxine）

正確答案：B. 生長激素（growth hormone）